The difference in blood pressure between the selected arm versus non-selected arm is = 20 mmHg for siSBP and = 10 mmHg for siDBP at Visit 1 (screening).

The above is a clinical trial exclusion criterion. Annotated with entity spans:
The [Measurement: difference in blood pressure] between the [Qualifier: selected arm versus non-selected arm] is [Value: = 20 mmHg] for [Measurement: siSBP] and [Value: = 10 mmHg] for [Measurement: siDBP] [Temporal: at Visit 1] (screening).